右心房的動脈供應主要來自下列何者？
A. 右冠狀動脈
B. 右冠狀動脈的邊緣枝（marginal branch）
C. 左冠狀動脈的迴旋枝（circumflex branch）
D. 左冠狀動脈的前室間枝（anterior interventricular branch）

正確答案：A. 右冠狀動脈